¿Qué característica no es común en las membranas biológicas?:
1. Son fluidas.
2. Están compuestas por lípidos y proteínas.
3. Son asimétricas.
4. Están eléctricamente polarizadas.
5. Los diversos componentes se ensamblan covalentemente.

Respuesta correcta: 5. Los diversos componentes se ensamblan covalentemente.